下列有關先天性免疫反應（innate immune responses）之敘述，何者錯誤？
A. 微生物引起的發炎反應屬於先天性免疫（innate immunity）
B. 病原菌之分子型式（pathogen-associated molecular patterns, PAMPs）引發先天性免疫反應
C. 辨識 PAMPs 之受器（receptors）與專一性之抗原受體（antigen receptor）類似，需經過基因重組後才能表現其蛋白質
D. 主要由吞噬細胞（phagocytes）執行

正確答案：C. 辨識 PAMPs 之受器（receptors）與專一性之抗原受體（antigen receptor）類似，需經過基因重組後才能表現其蛋白質